Clinical trial exclusion criterion:
Patients who have had an operative procedure involving the eye, ear, or central nervous system within one month;

Entity relations:
- Has_qualifier("operative procedure", "eye")
- Has_temporal("operative procedure", "within one month")
- OR("eye", "ear", "central nervous system")